下列那一種情況發生時是採用牽引療法（cervical traction）治療頸部疼痛的絕對禁忌症？
A. Spurling 測試陽性
B. Lhermitte 徵兆陽性
C. 頸椎退化性關節炎（degenerative arthritis of cervical spine）
D. 頸神經根病變（cervical radiculopathy）

正確答案：B. Lhermitte 徵兆陽性